人工陰莖植入術（penile prosthesis implantation）最常見的術後併發症而需開刀取出的情況為：
A. 尿道破裂
B. 陰囊血腫
C. 感染
D. 壓迫攝護腺引起排尿障礙

正確答案：C. 感染